Concurrent clinical diagnosis that significantly could affect test performance.

The above is a clinical trial exclusion criterion. Annotated with entity spans:
[Non-query-able: Concurrent clinical diagnosis that significantly could affect test performance].